Clinical trial inclusion criterion:
Ability to comply with completion of electronic diary.

Annotated entities:
- Observation: "comply with completion of electronic diary"
- Post-eligibility: "Ability to comply with completion of electronic diary."